Clinical trial inclusion criterion:
Diagnosed Iron deficiency anemia.

Annotated entities:
- Condition: "Iron deficiency anemia"